某酵素的kcat=500 s-１，Km=5 mM，在受質濃度遠高於Km的狀況下，此酵素反應的速率常數約為：
A. 500 s-１
B. 2,500 mM s-１
C. 100 mM-１s-１
D. 0.01 s mM-１

正確答案：A. 500 s-１